Clinical trial inclusion criterion:
(3)Voluntarily continues to participate in this study.

Annotated entities:
- Observation: "continues to participate in this study"
- Qualifier: "Voluntarily"